Cardiovascular symptoms (angina, limiting dyspnoea during normal physical activity)

The above is a clinical trial exclusion criterion. Annotated with entity spans:
[Condition: Cardiovascular symptoms] ([Condition: angina], limiting [Condition: dyspnoea] during normal physical activity)